Which effects create neighborhoods of transcriptional regulation in eukaryotes?

Enhancer Sharing Promotes Neighborhoods of Transcriptional Regulation Across Eukaryotes  We propose that enhancer sharing is commonplace among eukaryotes, and that EP distance is an important layer of information in gene regulation.